Clinical trial exclusion criterion:
Hypersensitivity to antiplatelet and/or anticoagulant drugs;

Annotated entities:
- Condition: "Hypersensitivity"
- Drug: "antiplatelet drugs"
- Drug: "anticoagulant drugs"